下列有關闌尾類癌（appendiceal carcinoid tumor）的敘述，何者錯誤？
A. 為闌尾（appendix）最常見的惡性腫瘤
B. 若是無症狀且小於 1 公分，單純作闌尾切除即可
C. 腫瘤若大於 2 公分，便有可能發生遠端轉移
D. 只要 size 大於 1 公分，一定要作 right hemicolectomy 才行

正確答案：D. 只要 size 大於 1 公分，一定要作 right hemicolectomy 才行